有關膠原蛋白（collagen）的生合成之敘述，何者錯誤？
A. 在 proline 及 lysine 常作後修飾（modification）
B. 需要 Vitamin C 的參與
C. 大部分由 glycine、alanine、proline 所組成
D. 後修飾只有 hydroxylation

正確答案：D. 後修飾只有 hydroxylation